Provided written consent for participation in the trial prior to any study-specific procedures or requirements.

The above is a clinical trial inclusion criterion. Annotated with entity spans:
Provided [Observation: written consent for participation in the trial] [Temporal: prior to any study-specific procedures or requirements].